Clinical trial exclusion criterion:
Prior receipt of investigational anti-HIV vaccine

Entity relations:
- Has_qualifier("anti-HIV vaccine", "investigational")
- Has_temporal("anti-HIV vaccine", "Prior")